Which microRNA is the mediator of the obesity phenotype of patients carrying 1p21.3 microdeletions?

MIR137 is the mediator of the obesity phenotype of patients carrying 1p21.3 microdeletions.